the history of thrombocytopenia or other thrombocytopenia with a definite diagnosis

The above is a clinical trial exclusion criterion. Annotated with entity spans:
the [Temporal: history] of [Condition: thrombocytopenia] or [Qualifier: other] [Condition: thrombocytopenia] with a definite diagnosis